下列何者不是人類乳突病毒（HPV）的主要高危險型病毒？
A. HPV 16
B. HPV 18
C. HPV 11
D. HPV 52

正確答案：C. HPV 11